having internal and surgical disease(after having variety of physical examination such as electrocardiogram/hepatic and renal function/blood routine and urine routine)

The above is a clinical trial exclusion criterion. Annotated with entity spans:
having [Condition: internal] and [Condition: surgical disease]([Temporal: after having variety of physical examination such as electrocardiogram/hepatic and renal function/blood routine and urine routine])